Dexamethasone use within last 3 months

The above is a clinical trial exclusion criterion. Annotated with entity spans:
[Drug: Dexamethasone] use [Temporal: within last 3 months]